罹患注意力缺損／過動症的兒童進入青少年和成年期之變化，下列何者錯誤？
A. 約有半數以上的兒童症狀會延續至成年
B. 造成症狀持續的危險因子有家族史、心理社會壓力、合併行為規範障礙或情緒焦慮疾患
C. 過動情形常變得更嚴重
D. 可能出現社交困難或偏差行為

正確答案：C. 過動情形常變得更嚴重